Clinical trial exclusion criterion:
6. Ischemic heart failure without the revascularization or undergone the revascularization within last 6 months;

Entity relations:
- Has_negation("revascularization", "without")
- Has_temporal("revascularization", "within last 6 months")
- Subsumes("Ischemic heart failure", "revascularization")
- OR("revascularization", "revascularization")